Transporte electrónico mitocondrial y fosforilación oxidativa:
1. Son dos procesos distintos, pero acoplados. Sin transporte electrónico nunca habrá fosforilación oxidativa.
2. Sin fosforilación oxidativa nunca podrá haber transporte electrónico.
3. El rendimiento neto de la fosforilación oxidativa es de aproximadamente 2.5 moles de ATP por mol de FADH2.
4. El cianuro es tóxico porque se une a la ATP sintasa.
5. Los agentes desacoplantes inhiben la ATP sintasa.

Respuesta correcta: 1. Son dos procesos distintos, pero acoplados. Sin transporte electrónico nunca habrá fosforilación oxidativa.